Use of home oxygen

The above is a clinical trial exclusion criterion. Annotated with entity spans:
Use of [Procedure: home oxygen]